Describe Heyde syndrome.

Classical Heyde syndrome is described as the association of aortic stenosis, bleeding gastrointestinal angiodysplasia and secondary anemia. A deficiency of high molecular weight multimers of von Willebrand factor (type 2A von Willebrand disease) provides the link between this association.